下列那一種藥物或狀況最不可能造成呼吸性鹼中毒？
A. 水楊酸鹽（salicylates）
B. 高山
C. 懷孕
D. 嗎啡（morphine）

正確答案：D. 嗎啡（morphine）